excessive thrombus (e.g. requires target vessel thrombectomy)

The above is a clinical trial exclusion criterion. Annotated with entity spans:
excessive [Condition: thrombus] (e.g. requires [Procedure: target vessel thrombectomy])